¿Cuál de las siguientes moléculas tiene al menos un ángulo de 90º?:
1. H2O.
2. NH3.
3. CH4.
4. SF4.
5. BF3.

Respuesta correcta: 4. SF4.